Trauma (including fractures)

The above is a clinical trial inclusion criterion. Annotated with entity spans:
[Condition: Trauma] (including [Condition: fractures])